El glucagón afecta a la glucosa sanguínea al:
1. Inhibir la degradación del glucógeno hepático.
2. Activar la glucólisis hepática.
3. Activar la gluconeogénesis hepática.
4. Inhibir la movilización de ácidos grasos.
5. Inhibir la cetogénesis hepática.

Respuesta correcta: 3. Activar la gluconeogénesis hepática.